陳先生今年 48 歲，常常覺得疲累，最近幾年愈來愈明顯。身體檢查發現有輕微黃疸外並無特別異常。血清學檢查發現 IgG anti-HCV 及 HCV RNA 陽性，anti-HAV 及 HBsAg 陰性。血清 AST 及 ALT 值升高。他的情況追蹤幾個月並沒有明顯的變化。下列何者是肝臟最可能的病理變化？
A. 毛玻璃樣肝細胞（ground-glass hepatocyte）
B. 門脈區旁肝細胞壞死（periportal necrosis）
C. 瀰漫性小泡性脂肪變性（diffuse microvesicular steatosis）
D. 次大塊性壞死（submassive necrosis）

正確答案：B. 門脈區旁肝細胞壞死（periportal necrosis）